Clinical trial inclusion criterion:
Born, raised and currently living at low altitude (<800m).

Entity relations:
- Has_value("living at low altitude", "<800m")